30 歲哺乳婦女，右側乳房乳暈邊呈現紅斑腫塊及壓痛，有四天的病史，將不建議下列何種處置？
A. Mammography
B. Sonography
C. Ultrasound guiding aspiration
D. 抗生素

正確答案：A. Mammography